Clinical trial inclusion criterion:
American Society of Anesthesiology (ASA) physical status class 1-3

Annotated entities:
- Measurement: "American Society of Anesthesiology physical status class"
- Value: "1-3"
- Measurement: "ASA"